Which diseases are involved in the severe cutaneous reactions (SCAR) spectrum?

The diseases that are involved in the severe cutaneous reactions (SCAR) spectrum are:
1) Stevens-Johnson syndrome (SJS)
2) Toxic epidermal necrolysis (TEN)
3) Acute generalized exanthematous pustulosis (AGEP).